unable to participate in a discussion about the study

The above is a clinical trial exclusion criterion. Annotated with entity spans:
[Non-query-able: unable to participate in a discussion about the study]